Measurable or non-measurable disease per RECIST Version 1.1.

The above is a clinical trial inclusion criterion. Annotated with entity spans:
[Condition: Measurable] or [Condition: non-measurable disease] per [Procedure: RECIST Version 1.1].